Clinical trial exclusion criterion:
Sarcoma or squamous cell histology.

Annotated entities:
- Condition: "Sarcoma"
- Condition: "squamous cell"
- Procedure: "histology"